Clinical trial inclusion criterion:
DSM-5 diagnosis of insomnia

Annotated entities:
- Condition: "insomnia"
- Qualifier: "DSM-5"